Age less than 10 years or greater than 55 years, at time of consent

The above is a clinical trial exclusion criterion. Annotated with entity spans:
[Person: Age] [Value: less than 10 years] or [Value: greater than 55 years], [Temporal: at time of consent]